eligible based on WALI screening tool

The above is a clinical trial inclusion criterion. Annotated with entity spans:
[Value: eligible] based on [Procedure: WALI screening tool]